Mental retardation

The above is a clinical trial exclusion criterion. Annotated with entity spans:
[Condition: Mental retardation]